Clinical trial exclusion criterion:
Treatment with statins during the past month prior to study.

Entity relations:
- Has_index("during the past month prior to study", "the past month prior to study")
- Has_temporal("statins", "during the past month prior to study")